Clinical trial exclusion criterion:
Unable to provide consent

Annotated entities:
- Informed_consent: "Unable to provide consent"